Clinical trial exclusion criterion:
Positive serum antibody against Hep B surface antigen and/or core Hep B core antigen

Entity relations:
- Has_value("serum antibody", "Positive")
- Has_qualifier("serum antibody", "Hep B surface antige")
- OR("Hep B surface antige", "core Hep B core antigen")